Patients who are considered by the investigator, for any reason, to be unable to self-administer the inhalation device.

The above is a clinical trial exclusion criterion. Annotated with entity spans:
[Post-eligibility: Patients who are considered by the investigator, for any reason, to be unable to self-administer the inhalation device].